Vasoconstriñe las arteriolas sistémicas:
1. Baja pO2.
2. Bajo pH.
3. Angiotensiona II.
4. Acetilcolina.
5. Óxido nítrico.

Respuesta correcta: 3. Angiotensiona II.